A型肉毒桿菌毒素（botulinum neurotoxin type A）應用於治療痙攣症（spasticity），何者錯誤？
A. 可以用來治療腦性麻痺（cerebral palsy）兒童的痙攣症（spasticity）
B. 治療途徑是肌肉注射（intramuscular injection）
C. 機轉是肉毒桿菌毒素抑制神經肌肉交接處（neuromuscular junction）的乙醯膽鹼（acetylcholine）的釋放
D. 注射效果會立即出現（immediate effect）

正確答案：D. 注射效果會立即出現（immediate effect）